Clinical trial inclusion criterion:
with multiple sclerosis according to the criteria of Mac Donald 2010 : relapsing-remitting (RR), secondary-progressive (SP) or primary-progressive (PP)

Entity relations:
- AND("criteria of Mac Donald 2010", "multiple sclerosis")
- Subsumes("relapsing-remitting", "RR")
- Subsumes("secondary-progressive", "SP")
- Subsumes("primary-progressive", "PP")
- Has_qualifier("multiple sclerosis", "relapsing-remitting")
- OR("relapsing-remitting", "secondary-progressive", "primary-progressive")